Clinical trial inclusion criterion:
Diagnostic and Statistical Manual of Mental Disorders, 4th Edition (DSM IV) test positive for dementia

Entity relations:
- Has_value("Diagnostic and Statistical Manual of Mental Disorders, 4th Edition (DSM IV) test", "positive")